Clinical trial exclusion criterion:
History of regular alcohol consumption within 6 months of the study defined as: An average weekly intake of >21 units for males or >14 units for females. One unit is equivalent to 8 gram of alcohol: a half-pint (approximately 240 milliliter [mL]) of beer, 1 glass (100 mL) of wine or 1 (25 mL) measure of spirits.

Annotated entities:
- Condition: "regular alcohol consumption"
- Temporal: "History"
- Temporal: "within 6 months of the study"
- Reference_point: "the study"
- Measurement: "average weekly intake"
- Value: ">21 units"
- Person: "males"
- Value: ">14 units"
- Person: "females"
- Parsing_Error: "One unit is equivalent to 8 gram of alcohol: a half-pint (approximately 240 milliliter [mL]) of beer, 1 glass (100 mL) of wine or 1 (25 mL) measure of spirits."